Clinical trial exclusion criterion:
Inability to provide written informed consent according to the Yale Human Investigation Committee (HIC) guidelines in English.

Entity relations:
- Has_negation("written informed consent", "Inability to provide")
- Has_qualifier("Yale Human Investigation Committee (HIC) guidelines", "in English")
- Has_qualifier("written informed consent", "Yale Human Investigation Committee (HIC) guidelines")